which mutations of phospholamban gene have been found to cause hypertrophic cardiomyopathy?

The following mutations of the phospholamban gene have been found to be associated with hypertrophic cardiomyopathy: PLN L39X nonsense mutation; PLN Leu39Ter; PLN -42 C>G  and PLN -77A-->G